Subject with a history of syncope within the last 6 months prior to screening

The above is a clinical trial exclusion criterion. Annotated with entity spans:
Subject with a history of [Condition: syncope] [Temporal: within the last 6 months prior to screening]